Clinical trial exclusion criterion:
Serum aspartate transaminase > 3 times upper limit of normal

Entity relations:
- Has_value("Serum aspartate transaminase", "> 3 times upper limit of normal")